有關糖尿病患者發生的神經性膀胱功能障礙（neuropathic bladder），下列何者是最早出現的膀胱功能障礙？
A. 解尿頻率（urination frequency）減少
B. 解尿開始（initiating micturition）困難
C. 無法抑制解尿（voiding uninhibition）
D. 溢流性尿失禁（overflow incontinence）

正確答案：A. 解尿頻率（urination frequency）減少